小美結婚 3 年，連續懷孕過 3 次，但是每次都在 8 週時就看不到胚胎心跳，下列敘述何者錯誤？
A. 小美已符合習慣性流產（habitual abortion）之定義
B. 臨床上會建議胎兒及小美夫妻雙方做染色體檢查（chromosomal analysis）
C. 自體免疫疾病（autoimmune disease，如 SLE）也容易造成習慣性流產
D. 可能和小美子宮頸閉鎖不全（cervical incompetence）有關

正確答案：D. 可能和小美子宮頸閉鎖不全（cervical incompetence）有關